Active and/or chronic protein losing enteropathy or plastic bronchitis (on inhaled medication to control the plastic bronchitis).

The above is a clinical trial exclusion criterion. Annotated with entity spans:
[Qualifier: Active] and/or [Qualifier: chronic] [Condition: protein losing enteropathy] or [Condition: plastic bronchitis] (on [Drug: inhaled medication] to control the plastic bronchitis).